下列何者較不會導致低血鈣（hypocalcemia）？
A. 低血鎂（hypomagnesemia）
B. 副甲狀腺低下症（hypoparathyroidism）
C. 服用利尿劑（thiazide）
D. 慢性腎衰竭

正確答案：C. 服用利尿劑（thiazide）